Clinical trial inclusion criteria:
Major subjects of over 40 years (mean age of Meniere's disease 40 to 50 years)
Informed consent signed
Medical examination performed prior to participation in research
Patients without history of inner ear disease
Recipient of a French social security scheme

Annotated entities:
- Value: "over 40 years"
- Person: "years"
- Non-query-able: "Informed consent signed"
- Procedure: "Medical examination"
- Temporal: "prior to participation in research"
- Condition: "inner ear disease"
- Temporal: "history"
- Negation: "without"
- Non-query-able: "Recipient of a French social security scheme"